Clinical trial exclusion criterion:
Other intervention for reduction of IAP planned

Entity relations:
- Has_mood("intervention for reduction of IAP", "planned")
- Has_qualifier("intervention for reduction of IAP", "Other")